Clinical trial inclusion criterion:
If repeat irradiation would exceed any normal tissue constraint set by MSKCC Radiation Oncology Department dose constraint criteria, the patient will potentially be eligible.

Entity relations:
- Has_value("MSKCC Radiation Oncology Department dose constraint criteria", "exceed any normal tissue constraint")
- AND("repeat irradiation", "MSKCC Radiation Oncology Department dose constraint criteria")